History of hypersensitivity to ARBs or dihydropyridines

The above is a clinical trial exclusion criterion. Annotated with entity spans:
[Temporal: History of] [Condition: hypersensitivity] to [Drug: ARBs] or [Drug: dihydropyridines]